Clinical trial exclusion criterion:
Acute rejection episode in the last 30 days, or episode > 2A in the Banff criteria;

Annotated entities:
- Condition: "Acute rejection episode"
- Temporal: "last 30 days"
- Measurement: "Banff criteria"
- Value: "> 2A"